Clinical trial inclusion criterion:
Age 19 years of age or older (The age of consent in Nebraska)

Annotated entities:
- Value: "19 years of age or older"
- Person: "Age"
- Non-representable: "(The age of consent in Nebraska)"